Clinical trial inclusion criteria:
Planned non-cardiac surgery at least after 12 months of implantation of drug eluting stent
Low or intermediate risk level surgery
Written informed consent

Annotated entities:
- Condition: "non-cardiac surgery"
- Temporal: "at least after 12 months of implantation of drug eluting stent"
- Reference_point: "implantation of drug eluting stent"
- Procedure: "implantation"
- Device: "drug eluting stent"
- Mood: "Planned"
- Procedure: "intermediate risk level surgery"
- Procedure: "risk level surgery Low"
- Observation: "Written informed consent"